下列關於神經性梅毒（neurosyphilis）之敘述，何者錯誤？
A. 在盤尼希林（penicillin）發明後，神經性梅毒較少發生，但自愛滋病出現以來，神經性梅毒再度受到醫學界之重視
B. 神經性梅毒對腦部之影響主要是顳葉，所以會產生類似精神分裂症患者之幻聽與妄想
C. 其腦脊髓液有淋巴球增多（lymphocytosis）及較多之蛋白質
D. 神經性梅毒通常在感染梅毒螺旋菌 10 至 15 年後發生

正確答案：B. 神經性梅毒對腦部之影響主要是顳葉，所以會產生類似精神分裂症患者之幻聽與妄想